Clinical trial inclusion criterion:
end diastolic diameter >60 mm and/or an ejection fraction <50%

Entity relations:
- Has_value("end diastolic diameter", ">60 mm")
- Has_value("ejection fraction", "<50%")
- OR("end diastolic diameter", "ejection fraction")